Clinical trial inclusion criterion:
Patients diagnosed with primary or secondary fibromyalgia.

Annotated entities:
- Condition: "fibromyalgia"
- Qualifier: "secondary"
- Qualifier: "primary"